下列何者供應膀胱血液？
A. 卵巢動脈
B. 陰道動脈
C. 直腸中動脈
D. 陰部內動脈

正確答案：B. 陰道動脈